Teniendo en cuenta la clasificación de la OMS de los métodos y medios de educación para la salud, las campañas de prevención de accidentes de tráfico llevadas a cabo en televisión se consideran un método:
1. Indirecto y visual.
2. Directo y visual.
3. Indirecto y audiovisual.
4. Mixto.
5. Mixto, sonoro, visual y audiovisual.

Respuesta correcta: 3. Indirecto y audiovisual.